ASA class 1 to 3 patients

The above is a clinical trial inclusion criterion. Annotated with entity spans:
[Measurement: ASA class] [Value: 1 to 3] patients